Which database exists that contains regulatory sites for splicing in human basal ganglia?

Braineacv2 is a database that contains regulatory sites for splicing in human basal ganglia.